How can B-cells transdifferentiate into macrophages?

Inflammatory macrophages can transdifferentiate into myofibroblasts during renal fibrosis . Vascular endothelial growth factor modified macrophage transdifferentiates into endothelial-like cells and decrease foam cell formation . Human cancer cells can be induced by C/EBPα to transdifferentiated into seemingly normal cells at high frequencies .